Clinical trial inclusion criterion:
Hemodynamically stable and appropriate for induction of labor as per primary clinical health team in house

Entity relations:
- AND("Hemodynamically stable", "induction of labor")